Clinical trial inclusion criterion:
The group of patients who participated in the study included adults aged at least 19 years among the atraumatic CA outpatients who came to the ER and received CPR.

Entity relations:
- Has_value("aged", "at least 19 years")